Pre-existing use of narcotics or opioids

The above is a clinical trial exclusion criterion. Annotated with entity spans:
[Temporal: Pre-existing] use of [Drug: narcotics] or [Drug: opioids]